Clinical trial exclusion criterion:
cognitive impairment (< 120 points on the Mattis Dementia Rating Scale)

Annotated entities:
- Condition: "cognitive impairment"
- Value: "< 120 points"
- Measurement: "Mattis Dementia Rating Scale"